Clinical trial exclusion criterion:
Pregnant or nursing woman.

Entity relations:
- OR("Pregnant", "nursing")